Compromised ability of the patient to give written informed consent and/or to comply with study procedures

The above is a clinical trial exclusion criterion. Annotated with entity spans:
[Condition: Compromised ability] of the patient to [Informed_consent: give written informed consent] and/or to [Non-representable: comply with study procedures]